Clinical trial inclusion criterion:
Patients free of active respiratory disease such as acute respiratory signs/symptoms (e.g., wheezing) or with active airways disease (asthma, chronic obstructive pulmonary disease or emphysema).

Annotated entities:
- Negation: "free"
- Condition: "respiratory disease"
- Qualifier: "active"
- Condition: "acute respiratory signs"
- Condition: "acute respiratory symptoms"
- Condition: "wheezing"
- Condition: "airways disease"
- Qualifier: "active"
- Condition: "asthma"
- Condition: "chronic obstructive pulmonary disease"
- Condition: "emphysema"